Chronic obstructive pulmonary disease

The above is a clinical trial exclusion criterion. Annotated with entity spans:
[Condition: Chronic obstructive pulmonary disease]